Utilizando la metodología enfermera, un determinado paciente tiene como diagnóstico Dolor Agudo, ¿a qué dominio pertenece este diagnóstico?:
1. Confort.
2. Afrontamiento/tolerancia al estrés.
3. Principios vitales.
4. Autopercepción.

Respuesta correcta: 1. Confort.